Clinical trial exclusion criterion:
Exclusion criteria includes ICUs with an average length of stay of less than 2 days;

Entity relations:
- Has_value("average length of stay", "less than 2 days")
- AND("ICUs", "average length of stay")